Clinical trial inclusion criterion:
No use of non-steroid anti-inflammatory agent one week before operation

Entity relations:
- Has_index("one week before operation", "operation")
- Has_temporal("non-steroid anti-inflammatory agent", "one week before operation")
- Has_negation("non-steroid anti-inflammatory agent", "No")